Clinical trial inclusion criterion:
Age older than 30 years

Entity relations:
- Has_value("Age", "older than 30 years")